Which mutated gene causes the Chédiak–Higashi Syndrome?

Mutation in the lysosomal trafficking regulator (LYST) gene causes the Chédiak-Higashi syndrome (CHS).